Clinical trial exclusion criterion:
liver dysfunction with a factor of at least 3 above the upper limit of normal in AST and ALT levels

Annotated entities:
- Condition: "liver dysfunction"
- Value: "factor of at least 3 above the upper limit of normal"
- Measurement: "AST levels"
- Measurement: "ALT levels"